Describe the Disambiguate algorithm and its application in next generation sequencing data

Disambiguate is an open-source application for disambiguating two species in next generation sequencing data from grafted samples. The method is based on an iterative Bayesian approach which uses sequence alignment information from germline genotype data to identify putative cis-regulatory elements which may be involved in the regulation of gene expression. The input to the method is a set of sequence elements known to be of interest to the genomics research community, and the outputs are calls for inclusion of putative regulatory elements such as enhancers, transcription factor binding sites, enhancers and enhancers